19. Any lesion that is located in a saphenous vein graft, however, lesions located within the native vessel but accessed through the graft are eligible.

The above is a clinical trial exclusion criterion. Annotated with entity spans:
19. Any [Condition: lesion] that is [Qualifier: located in a saphenous vein graft], however, lesions located [Qualifier: within the native vessel] but [Qualifier: accessed through the graft] [Grammar_Error: are eligible].